Multiorgan transplants and/or previously transplanted with any other organ than kidney.

The above is a clinical trial exclusion criterion. Annotated with entity spans:
[Procedure: Multiorgan transplants] and/or [Temporal: previously] [Procedure: transplanted with any other organ than kidney].